Male or female

The above is a clinical trial inclusion criterion. Annotated with entity spans:
[Person: Male] or [Person: female]